Active cancer

The above is a clinical trial exclusion criterion. Annotated with entity spans:
[Temporal: Active] [Condition: cancer]